Clinical trial exclusion criterion:
History of meningococcal diseases, confirmed either clinically, serologically, or microbiologically

Entity relations:
- AND("meningococcal diseases", "serologically")
- AND("meningococcal diseases", "microbiologically")
- Has_value("serologically", "confirmed")
- Has_value("microbiologically", "confirmed")